Clinical trial exclusion criterion:
hypoventilation

Annotated entities:
- Condition: "hypoventilation"